有一新生兒發生腸阻塞，腹部 X 光發現腹內有鈣化現象，則下列何者是最可能的解釋？
A. 腹內有出血
B. 腹內腫瘤且有壞死
C. 胎兒時有小腸穿孔
D. 結石造成腸阻塞

正確答案：C. 胎兒時有小腸穿孔